Clinical trial exclusion criterion:
History of life threatening asthma: Defined as an asthma episode that required intubation and/or was associated with hypercapnea, respiratory arrest or hypoxic seizures within the last 6 months.

Annotated entities:
- Qualifier: "life threatening"
- Condition: "asthma"
- Condition: "asthma episode"
- Qualifier: "required intubation"
- Procedure: "intubation"
- Condition: "hypercapnea"
- Condition: "respiratory arrest"
- Condition: "hypoxic seizures"
- Temporal: "within the last 6 months"